alpha 1-antitrypsin deficiency: Subjects with known alpha-1 antitrypsin deficiency as the underlying cause of COPD.

The above is a clinical trial exclusion criterion. Annotated with entity spans:
[Condition: alpha 1-antitrypsin deficiency]: Subjects with known [Condition: alpha-1 antitrypsin deficiency] as the underlying cause of [Condition: COPD].